維生素 D 缺乏佝僂症（vitamin D deficiency rickets）的病童，下列那一種檢查結果最為罕見？
A. 正常血鈣值
B. 低血磷值（Hypophosphatemia）
C. 正常血清副甲狀腺素濃度
D. 正常血清 1,25-Dihydroxyvitamin D 濃度

正確答案：C. 正常血清副甲狀腺素濃度